下列各類致病菌中，何者只需中和抗體（neutralizing antibody）就可中和毒素而不致病？
A. 金黃色葡萄球菌（Staphylococcus aureus）
B. 白色念珠菌（Candida albicans）
C. 麻瘋桿菌（Mycobacterium leprae）
D. 破傷風桿菌（Clostridium tetani）

正確答案：D. 破傷風桿菌（Clostridium tetani）